A positive pre-study drug/alcohol screen.

The above is a clinical trial exclusion criterion. Annotated with entity spans:
A [Value: positive] [Temporal: pre-study] [Measurement: drug]/[Measurement: alcohol screen].